Which are the ligands of the Roundabout (Robo) receptors?

Roundabouts comprise a family of single-pass transmembrane receptors facilitating this process upon interaction with the soluble extracellular ligand Slit protein family emanating from the midline.